Clinical trial inclusion criteria:
Midsubstance pain in the achilles tendon
Symptoms for at least 3 months
Ultrasound scanning at the first visit shows thickness of the achilles tendon above 7 mm or 20% thicker than the contralateral.
Patient can read and understand danish

Annotated entities:
- Condition: "Midsubstance pain"
- Qualifier: "achilles tendon"
- Condition: "Symptoms"
- Temporal: "for at least 3 months"
- Procedure: "Ultrasound scanning"
- Temporal: "at the first visit"
- Condition: "thickness of the achilles tendon"
- Qualifier: "above 7 mm"
- Qualifier: "20% thicker than the contralateral"
- Non-query-able: "Patient can read and understand danish"